Clinical trial inclusion criterion:
Has access to transportation to visit the blood collection facility and to return to Stony Brook for all study visits.

Annotated entities:
- Non-query-able: "Has access to transportation to visit the blood collection facility and to return to Stony Brook for all study visits."